Clinical trial inclusion criterion:
BCVA of 77 to 20 letters assessed with the use of ETDRS charts

Entity relations:
- Has_value("BCVA", "77 to 20 letters")